Pregnant women or women with potential childbearing

The above is a clinical trial exclusion criterion. Annotated with entity spans:
[Condition: Pregnant] [Person: women] or [Person: women] with [Condition: potential childbearing]